recent surgery (< 3 months)

The above is a clinical trial exclusion criterion. Annotated with entity spans:
[Temporal: recent] [Procedure: surgery] ([Temporal: < 3 months])